Uno de los siguientes parámetros farmacocinéticos es el que define la biodisponibilidad de un fármaco:
1. El volumen Aparente de Distribución del fármaco.
2. Al aclaramiento Total del fármaco.
3. La Constante de Absorción.
4. El Área Bajo la Curva de las concentraciones del fármaco frente al Tiempo.

Respuesta correcta: 4. El Área Bajo la Curva de las concentraciones del fármaco frente al Tiempo.